Known history of severe hepatic impairment

The above is a clinical trial inclusion criterion. Annotated with entity spans:
Known history of [Qualifier: severe] [Condition: hepatic impairment]